Clinical trial exclusion criterion:
5. Active and uncontrolled malignancy

Entity relations:
- Has_temporal("malignancy", "Active")
- Has_qualifier("malignancy", "uncontrolled")